¿Cuál      de estos enunciados NO es una característica de los ensayos clínicos fase I?
1. Suelen tener objetivos no terapéuticos.
2. Pueden realizarse en voluntarios sanos.
3. Pueden realizarse en pacientes.
4. Suelen ser aleatorizados.
5. Suelen ser abiertos.

Respuesta correcta: 4. Suelen ser aleatorizados.